Clinical trial exclusion criterion:
Need for acute psychiatric hospitalization or is suicidal

Annotated entities:
- Procedure: "psychiatric hospitalization"
- Observation: "Need for"
- Temporal: "acute"
- Condition: "suicidal"